Clinical trial exclusion criterion:
19. Subjects must not donate blood while on study and for at least 90 days following the last MEDI4736 treatment.

Entity relations:
- Has_negation("donate blood", "not")
- Has_index("while on study", "on study")
- Has_index("for at least 90 days following the last MEDI4736 treatment", "the last MEDI4736 treatment")
- Has_temporal("donate blood", "while on study")
- Has_temporal("donate blood", "for at least 90 days following the last MEDI4736 treatment")